Documented positive hepatitis B (HBV) surface antigen, and/or HBV DNA prior to enrollment

The above is a clinical trial exclusion criterion. Annotated with entity spans:
Documented [Value: positive] [Measurement: hepatitis B] (HBV) surface antigen, and/or [Measurement: HBV DNA] [Temporal: prior to enrollment]